Which X chromosome abnormalities present lupus-like symptoms?

X-chromosomal abnormalities in patients with SLE present lupus-like symptoms. X-chromatin abnormality on X chromosome 14q11.2, which encodes X-linked leiomyosarcoma, is the most common chromosomal abnormality in SLE. There is also a publication that links X- chromosome abnormalities to lupUS disease with synostosis.